Clinical trial exclusion criterion:
5. Known allergies to: aspirin, clopidogrel (Plavix) and ticlopidine (Ticlid), heparin, bivalirudin, stainless steel, or contrast agent (which cannot be adequately premedicated).

Entity relations:
- AND("allergies", "aspirin")
- OR("aspirin", "clopidogrel", "Plavix", "ticlopidine", "Ticlid", "heparin", "bivalirudin", "stainless steel", "contrast agent")